What is another name for  keratomileusis?

Laser in situ keratomileusis (LASIK)